Li-Fraumeni 徵候是一種罕見遺傳的疾病，病患家族的成員很容易在 30 歲前得到各種癌症，這個家族的問題是他們遺傳了一個突變的 p53 基因。另外，人類癌症中一半以上可發現有 p53 基因的 somatic mutations。下列關於 p53 之敘述何者錯誤？
A. 正常 p53 為抑癌基因（tumor suppressor gene）
B. 正常 p53 參與細胞週期（cell cycle）的調控
C. 正常 p53 為 transcription factor，可與特定 DNA 序列結合
D. 正常 p53 主要分布於細胞膜上，可接受外來訊號

正確答案：D. 正常 p53 主要分布於細胞膜上，可接受外來訊號